Clinical trial exclusion criterion:
Subjects who are known, current alcohol and/or drug abusers

Entity relations:
- OR("alcohol abusers", "drug abusers")